Current height less than 5th percentile AND/OR

The above is a clinical trial inclusion criterion. Annotated with entity spans:
[Temporal: Current] [Measurement: height] [Value: less than 5th percentile] [Non-representable: AND/OR]